下列何結構是由後腦（metencephalon）衍生而來？
A. 延腦（medulla oblongata）
B. 小腦（cerebellum）
C. 丘腦（thalamus）
D. 下丘腦（hypothalamus）

正確答案：B. 小腦（cerebellum）